Clinical trial inclusion criterion:
3. Must have baseline bone marrow sample taken.

Entity relations:
- Has_temporal("bone marrow sample", "baseline")